Clinical trial inclusion criterion:
Patients who require medication for more than 12 weeks due to osteoarthritis symptoms.

Entity relations:
- Has_multiplier("medication", "more than 12 weeks")
- AND("osteoarthritis symptoms", "medication")